Clinical trial exclusion criterion:
Chronic or recurrent uveitis.

Annotated entities:
- Multiplier: "Chronic"
- Multiplier: "recurrent"
- Condition: "uveitis"